15 weeks 0 days gestational age - 23 weeks 5 days gestational age at time of dilator insertion

The above is a clinical trial inclusion criterion. Annotated with entity spans:
[Value: 15 weeks 0 days] [Measurement: gestational age] - 23 weeks 5 days gestational age [Temporal: at time of dilator insertion]